Clinical trial exclusion criterion:
Diagnosis of attention-deficit hyperactivity disorder (ADHD) is allowed, provided the patient is not receiving medication(s) known to affect the assessment of RLS.

Entity relations:
- Subsumes("attention-deficit hyperactivity disorder", "ADHD")
- AND("allowed", "attention-deficit hyperactivity disorder")